La molécula de SO2 es:
1. Lineal, con el átomo de S en el centro.
2. Lineal, con uno de los átomos de O en el centro.
3. Angular, con el átomo de S en el centro y con un ángulo próximo a 120º (triángulo equilátero) y un par de electrones libre.
4. Angular, con uno de los átomos de O en el centro y con un ángulo aproximado a 120º (triángulo equilátero) y un par de electrones libres.
5. Angular, con el átomo de S en el centro y con un ángulo próximo a 109º (tetraedro) y dos pares de electrones libres.

Respuesta correcta: 3. Angular, con el átomo de S en el centro y con un ángulo próximo a 120º (triángulo equilátero) y un par de electrones libre.